Clinical trial exclusion criterion:
Active malignant (p.e. any kind of cancer) or treated disease, to which the individual may relapse during the study;

Entity relations:
- Has_qualifier("cancer", "any kind")
- Subsumes("malignant disease", "cancer")
- Has_temporal("malignant disease", "Active")
- Has_temporal("to which the individual may relapse", "during the study")
- Has_qualifier("malignant disease", "to which the individual may relapse")
- Has_index("during the study", "the study")
- Has_qualifier("treated", "to which the individual may relapse")
- Has_qualifier("treated", "to which the individual may relapse")
- Has_qualifier("malignant", "to which the individual may relapse")
- OR("malignant disease", "treated disease")